脊椎轉移性腫瘤中最常轉移的位置為：
A. 頸椎
B. 胸椎
C. 腰椎
D. 薦椎

正確答案：B. 胸椎